Clinical trial inclusion criterion:
At least 4 weeks since last surgery or radiation therapy.

Annotated entities:
- Temporal: "At least 4 weeks since last surgery or radiation therapy"
- Reference_point: "last surgery"
- Reference_point: "radiation therapy"